received antiviral therapy for any systemic anti-viral, anti-neoplastic or immuno-modulatory treatment (including supraphysiologic doses of steroids and radiation) within the past 6 months.

The above is a clinical trial exclusion criterion. Annotated with entity spans:
received [Procedure: antiviral therapy] for any [Drug: systemic anti-viral], [Procedure: anti-neoplastic] or [Procedure: immuno-modulatory treatment] (including [Multiplier: supraphysiologic doses] of [Drug: steroids] and [Procedure: radiation]) [Temporal: within the past 6 months].